70歲長者在大腿內側及前臂屈側、腋窩、腹股溝及下腹部之皮膚有多個水泡（bullae），組織切片呈現表皮下非棘層鬆解的水泡（subepidermal nonacantholytic blisters），免疫螢光檢查見免疫球蛋白及補體呈線形沉積於基底膜部位，其診斷為何？
A. 尋常性天疱瘡（pemphigus vulgaris）
B. 紅斑性天疱瘡（pemphigus erythematosus）
C. 大水泡性類天疱瘡（bullous pemphigoid）
D. 疱疹性皮炎（dermatitis herpetiformis）

正確答案：C. 大水泡性類天疱瘡（bullous pemphigoid）